Clinical trial exclusion criterion:
Hormonal treatment involving estrogen or progesterone 3 months prior to or during the study period, with the exception of medroxyprogesterone acetate for withdrawal bleeding.

Annotated entities:
- Drug: "estrogen"
- Drug: "progesterone"
- Temporal: "3 months prior to the study period"
- Temporal: "during the study period"
- Drug: "medroxyprogesterone acetate"
- Condition: "withdrawal bleeding"
- Negation: "exception"